La utilización del efecto Zeeman para la corrección del fondo se basa en que:
1. La absorción del fondo se debe, fundamentalmente, a interferencias espectrales, las cuales están afectadas por la presencia de un campo magnético polarizado, a diferencia de lo que ocurre si no hay interferencias espectrales.
2. La absorción del fondo debida a, fundamentalmente, a la presencia de partículas refractarias, ésta afectada por la presencia de un campo magnético.
3. La absorción del fondo se debe, fundamentalmente, a dispersiones y absorción molecular, la cual no es afectada por la presencia de un campo magnético, contrariamente a lo que sucede con la absorción atómica.
4. La absorción del fondo se debe, fundamentalmente, a radiación polarizada, la cual es afectada por la presencia de un campo magnético, contrariamente a lo que sucede con la lámpara de cátodo hueco.

Respuesta correcta: 3. La absorción del fondo se debe, fundamentalmente, a dispersiones y absorción molecular, la cual no es afectada por la presencia de un campo magnético, contrariamente a lo que sucede con la absorción atómica.